Clinical trial exclusion criterion:
Subject has chronic obstructive pulmonary disease with detected pulmonary hypertension or any other evidence of significant lung disease.

Entity relations:
- Has_qualifier("lung disease", "significant")
- AND("chronic obstructive pulmonary disease", "pulmonary hypertension")
- OR("pulmonary hypertension", "lung disease")